Clinical trial exclusion criterion:
patients in therapy with anticoagulants or antiaggregants;

Annotated entities:
- Drug: "anticoagulants"
- Drug: "antiaggregants"
- Procedure: "therapy"